Baseline ALT more than 3 times UNL

The above is a clinical trial exclusion criterion. Annotated with entity spans:
[Temporal: Baseline] [Measurement: ALT] [Value: more than 3 times UNL]